Clinical trial exclusion criterion:
Not pregnant

Annotated entities:
- Condition: "pregnant"